Clinical trial exclusion criterion:
Patients with clinical signs of raised ICP.

Entity relations:
- Has_value("ICP", "raised")